Clinical trial inclusion criterion:
has a negative pregnancy test on the day of vaccination and

Annotated entities:
- Value: "negative"
- Measurement: "pregnancy test"
- Temporal: "on the day of vaccination"
- Reference_point: "vaccination"